Clinical trial inclusion criterion:
All women of childbearing potential (WOCBP) must be practicing a medically acceptable method of birth control

Annotated entities:
- Person: "women"
- Condition: "childbearing potential"
- Condition: "WOCBP"
- Qualifier: "medically acceptable"
- Procedure: "birth control"